Acude a su consulta Pablo, hombre de 58 años, que tiene un pequeño comercio en la zona adscrita al Centro de Salud donde usted le está atendiendo. Pablo está casado con Pilar de 57 años que se dedica por completo al cuidado de sus dos hijas (de 13 y 14 años) y la madre de Pablo que tiene 82 años, y a la que el propio Pablo define como “gran dependiente”. Durante la entrevista Pablo se muestra cansado, preocupado por el estado físico y anímico de su mujer y comenta que en la localidad de al lado, que es tan grande como la suya y que tiene la misma proporción de mayores dependientes, “han abierto un centro de día para mayores y eso nosotros también lo necesitamos”. Señale la respuesta correcta que indica el tipo de necesidad que Pablo muestra:
1. Sentida.
2. Comparada.
3. Normativa.
4. Expresada.

Respuesta correcta: 2. Comparada.